Subjects with known intolerance to blood products or to one of the components of the study product or is unwilling to receive blood products;

The above is a clinical trial exclusion criterion. Annotated with entity spans:
Subjects with known [Condition: intolerance] to [Procedure: blood products] or [Non-query-able: to one of the components of the study product or is unwilling to receive blood products];